Clinical trial exclusion criterion:
Planned bariatric surgery during the study or prior bariatric surgical procedures

Entity relations:
- Has_mood("bariatric surgery", "Planned")
- Has_temporal("bariatric surgery", "during the study")
- Has_index("during the study", "the study")
- AND("prior", "bariatric surgical procedures")
- OR("bariatric surgery", "bariatric surgical procedures")